Clinical trial exclusion criterion:
Left ventricular ejection fraction less than 50 per cent

Annotated entities:
- Measurement: "Left ventricular ejection fraction"
- Value: "less than 50 per cent"